Pregnancy and lactation

The above is a clinical trial exclusion criterion. Annotated with entity spans:
[Condition: Pregnancy] [Grammar_Error: and] [Condition: lactation]